Patients taking any experimental therapies history of another malignancy within 5 years prior to study entry except curatively treated non-melanoma skin cancer, prostate cancer, or cervical cancer in situ

The above is a clinical trial exclusion criterion. Annotated with entity spans:
[Non-representable: Patients taking any experimental therapies] [Temporal: history of] [Condition: another malignancy] [Temporal: within 5 years prior to study entry] [Negation: except] [Qualifier: curatively treated] [Condition: non-melanoma skin cancer], [Condition: prostate cancer], or [Condition: cervical cancer in situ]